霍亂弧菌（Vibrio cholerae）會產出霍亂毒素（cholera toxin），催化Gsα（即stimulatory G蛋白α次單元）之 ADP-ribosylation，而使Gsα的GTPase活性受抑制，下列有關此毒素作用在病人腸內上皮細胞之敘述何者錯誤？
A. 細胞中Gsα無法活化下游效應物（effectors）
B. 細胞中Gsα與Gs蛋白βγ次單元的重新結合（re-association）受到抑制
C. 細胞中adenylyl cyclase持續活化
D. 細胞中cAMP增加

正確答案：A. 細胞中Gsα無法活化下游效應物（effectors）